下列何者會先被病毒的thymidine kinase磷酸化而干擾病毒複製，因此對被感染的細胞具選擇性，主要用於治療疱疹病毒（herpes viruses）的感染？
A. abacavir
B. acyclovir
C. amantadine
D. azidothymidine

正確答案：B. acyclovir